Clinical trial exclusion criterion:
Patients with a history of an untreated malignancy (except local skin cancers)

Entity relations:
- Has_qualifier("malignancy", "untreated")
- Has_negation("local skin cancers", "except")
- AND("malignancy", "local skin cancers")